Which conditions are manifested by TRIM8 mutations?

TRIM8 mutations are associated with epilepsy, epileptic encephalopathy, developmental delay and intellectual disability.